Clinical trial inclusion criterion:
Diagnostic or therapeutic procedures

Annotated entities:
- Procedure: "therapeutic procedures"
- Procedure: "Diagnostic procedures"